Patients scheduled for dental extraction and treated with edoxaban, apixaban, rivaroxaban or dabigatran

The above is a clinical trial inclusion criterion. Annotated with entity spans:
Patients [Mood: scheduled for] [Procedure: dental extraction] and treated with [Drug: edoxaban], [Drug: apixaban], [Drug: rivaroxaban] or [Drug: dabigatran]